En un ensayo clínico aleatorizado de fase III se comparó la eficacia de un nuevo analgésico (experimental) con un tratamiento control (tramadol) en pacientes con dolor crónico. La hipótesis de trabajo era que el tratamiento experimental reduce el dolor más que el tramadol. El efecto de los dos tratamientos se determinó a las 48 horas mediante la reducción de la puntuación marcada por el paciente en una escala analógica - visual de 0 a 100 mm. La reducción media en el grupo tramadol fue de -27 y en el grupo experimental de -31. Se hizo el contraste de hipótesis para las diferencias, con la correspondiente prueba estadística y se obtuvo un valor de p = 0,03. Respecto al estudio anterior, ¿cuál de las siguientes conclusiones le parece más correcta?
1. El estudio demostró diferencias clínicamente relevantes.
2. Las diferencias en el efecto analgésico entre los dos tratamientos estudiados fueron significativas.
3. El beneficio - riesgo del tratamiento experimental fue mejor que el del tramadol.
4. El tratamiento experimental fue un 20 % mejor que el tramadol.
5. Podemos recomendar el uso generalizado del tratamiento experimental, porque es más eficaz que el tramadol en el tratamiento del dolor crónico.

Respuesta correcta: 2. Las diferencias en el efecto analgésico entre los dos tratamientos estudiados fueron significativas.